Clinical trial exclusion criterion:
thyroid dysfunction, with serum TSH out of normal limits

Entity relations:
- Has_value("serum TSH", "out of normal limits")
- AND("thyroid dysfunction", "serum TSH")